Clinical trial exclusion criterion:
Age = 17.

Entity relations:
- Has_value("Age", "= 17")